Clinical trial exclusion criterion:
Chronic hypertension receiving antihypertensive treatment

Annotated entities:
- Condition: "Chronic hypertension"
- Procedure: "antihypertensive treatment"